Clinical trial exclusion criterion:
Treatment with MMF at >1.5 g/D for over 4 weeks within the past 3 months.

Entity relations:
- Has_multiplier("MMF", ">1.5 g/D for over 4 weeks")
- Has_temporal("MMF", "past 3 months")